Clinical trial inclusion criterion:
Completed the initial routine ante-natal examination at the clinics

Annotated entities:
- Condition: "routine ante-natal examination"
- Visit: "clinics"